Clinical trial inclusion criterion:
Patient and designee capable of giving fully informed consent in writing

Annotated entities:
- Post-eligibility: "Patient and designee capable of giving fully informed consent in writing"